Clinical trial inclusion criterion:
18 years of age or older;

Annotated entities:
- Person: "age"
- Value: "18 years or older"